關於免疫球蛋白（抗體），下列敘述何者錯誤？
A. 成熟的B淋巴球可製造特異性的免疫球蛋白
B. IgＭ能通過胎盤使新生兒獲得抗體
C. IgE濃度增加代表個體產生過敏反應或受寄生蟲感染
D. 每個抗體分子均由二對多肽鏈組成，共包含兩條重鏈與兩條輕鏈

正確答案：B. IgＭ能通過胎盤使新生兒獲得抗體